有關骨盆骨折的敘述，下列何者為非？
A. 骨盆骨折最危險的併發症為出血（hemorrhage）
B. 骨盆骨折病患死亡最常見的原因是因為腹部同時傷害（abdominal injury）
C. 約 15%骨盆骨折病患合併泌尿生殖系統傷害（urologic injuries）
D. 在男性骨盆骨折患者尿道口有出血時（blood at urethral meatus），施行逆行性膀胱尿道攝影

正確答案：B. 骨盆骨折病患死亡最常見的原因是因為腹部同時傷害（abdominal injury）